Clinical trial inclusion criterion:
Male and females between ages 18-85 years

Annotated entities:
- Person: "Male"
- Person: "females"
- Value: "between 18-85 years"
- Person: "ages"